Hombre de 66 años de edad, diagnosticado previamente de cirrosis hepática de etiología alcohólica, que es traído al servicio de Urgencias por aumento del perímetro abdominal y desorientación     temporo-espacial.      En    la exploración física se constata la existencia de ascitis y de “flapping tremor” o asterixis. ¿Cuál de las siguientes exploraciones debe realizarse con carácter urgente?
1. Una tomografía computarizada craneal para descartar un accidente cerebro-vascular.
2. Una ecografía abdominal para confirmar la presencia de ascitis.
3. Una paracentesis exploradora para descartar una peritonitis bacteriana espontánea.
4. Un electroencefalograma para confirmar la existencia de encefalopatía hepática.
5. Una tomografía computarizada abdominal para descartar un carcinoma hepatocelular.

Respuesta correcta: 3. Una paracentesis exploradora para descartar una peritonitis bacteriana espontánea.